Clinical trial exclusion criterion:
History of head injury or stroke,

Entity relations:
- Has_temporal("head injury", "History")
- Has_temporal("stroke", "History")
- OR("head injury", "stroke")